Clinical trial exclusion criterion:
Patients with systemic, rheumatic or inflammatory disease of the knee or chondrocalcinosis, hemochromatosis, inflammatory arthritis, arthropathy of the knee associated with juxta-articular Paget's disease of the femur or tibia, hemophilic arthropathy, infectious arthritis, Charcot's knee joint, villonodular synovitis, and synovial chondromatosis

Entity relations:
- Has_qualifier("systemic disease", "knee")
- Has_qualifier("Paget's disease", "juxta-articular")
- Has_qualifier("Paget's disease", "femur")
- OR("femur", "tibia")
- OR("systemic disease", "rheumatic disease", "inflammatory disease")
- OR("systemic disease", "chondrocalcinosis", "hemochromatosis", "inflammatory arthritis", "arthropathy of the knee", "hemophilic arthropathy", "infectious arthritis", "Charcot's knee joint", "villonodular synovitis", "synovial chondromatosis")